一位 25 歲男性病人因最近一星期開始產生明顯幻聽及被害妄想而被送來急診，醫師幫其做一般身體檢查及生化檢查，一切正常，他也未曾有藥物及酒精濫用史，也未曾有明顯之腦傷史。其病史為在 20 歲時開始有陣發性之強直-陣攣癲癇發作（tonic-clonic seizures），服藥後症狀明顯改善。最近一週因感冒而未服抗癲癇藥，於這一週內被發現有多次之強直-陣攣癲癇發作。下列敘述何者正確？
A. 癲癇發作引起之精神病，最常發生在每次癲癇發作之後（postictal psychosis）
B. 與其他大腦位置比較，顳葉病灶引起之癲癇，較易產生精神病症狀
C. 與女性癲癇患者比較，男性癲癇患者較易產生精神病
D. 癲癇發作引起之精神病與精神分裂症相似，也會產生明顯之聯想鬆弛之症狀

正確答案：B. 與其他大腦位置比較，顳葉病灶引起之癲癇，較易產生精神病症狀